Clinical trial inclusion criterion:
The ability to perform a small visible contraction with dorsiflexion and hip flexor muscles

Entity relations:
- Has_mood("small visible contraction with dorsiflexion and hip flexor muscles", "The ability to")